Clinical trial exclusion criterion:
Known severe renal (creatinine clearance <30ml/min) or hepatic insufficiency as well as Alanine transaminase (ALT)/aspartate transaminase (AST) elevations = 3xUpper limit normal (ULN); isolated AST-elevation is not considered an exclusion criteria from study participation

Annotated entities:
- Measurement: "creatinine clearance"
- Value: "<30ml/min"
- Condition: "hepatic insufficiency"
- Measurement: "Alanine transaminase (ALT)"
- Measurement: "aspartate transaminase (AST)"
- Value: "elevations"
- Value: "3xUpper limit normal (ULN)"
- Condition: "renal insufficiency"
- Qualifier: "severe"